Clinical trial exclusion criterion:
Use of oral contraceptive pills, patches, implants or hormonal intrauterine contraception in the month prior to screening

Entity relations:
- Has_index("in the month prior to screening", "screening")
- Has_temporal("oral contraceptive pills", "in the month prior to screening")
- OR("oral contraceptive pills", "implants", "hormonal intrauterine contraception", "patches")